腹腔鏡手術目前較適合使用於那一種癌症的手術？
A. 卵巢癌
B. 子宮內膜癌
C. 輸卵管癌
D. 外陰癌

正確答案：B. 子宮內膜癌